benzodiazepines

The above is a clinical trial exclusion criterion. Annotated with entity spans:
[Drug: benzodiazepines]